25歲女性，3天前胚胎植入，因呼吸不適至急診求診，超音波下可見雙側卵巢皆大於8公分，大量腹水，病患主訴尿量減少。下列敘述何者最不正確？
A. 應趕快給予利尿劑
B. 在輸液選擇方面，saline優於lactated Ringer's solution
C. 臥床可降低卵巢扭轉的風險
D. 若病患成功懷孕，症狀可能加重

正確答案：A. 應趕快給予利尿劑